uncontrolled diabetes mellitus type 2 with fasting glucose > 13.3 mmol/l confirmed on a second day

The above is a clinical trial exclusion criterion. Annotated with entity spans:
[Qualifier: uncontrolled] [Condition: diabetes mellitus type 2] with [Measurement: fasting glucose] [Value: > 13.3 mmol/l] confirmed on a second day